Women in pregnancy or lactation, or female of child bearing potential without appropriate birth control measures.

The above is a clinical trial exclusion criterion. Annotated with entity spans:
[Pregnancy_considerations: Women in pregnancy or lactation, or female of child bearing potential without appropriate birth control measures.]